Clinical trial inclusion criterion:
Symptomatic, permanent AF of at least three months duration

Annotated entities:
- Qualifier: "Symptomatic"
- Qualifier: "permanent"
- Condition: "AF"
- Multiplier: "at least three months duration"